一位 53 歲男性病患，主訴有腹痛。其腹部超音波及電腦斷層掃描顯示主胰臟管均相當擴大及胰臟頭部有囊狀病灶的變化，且病人血清的 amylase 為 720 IU/L，lipase 為 1,200 IU/L，而其 ERCP 呈現胰管及 ampulla of Vater 擴張及有黏液性物質流出。本病人最可能的診斷為：
A. mucinous cystadenoma
B. serous cystadenoma
C. intraductal mucin-producing tumor
D. papillary and cystic tumor of the pancreas

正確答案：C. intraductal mucin-producing tumor